Clinical trial inclusion criterion:
Completion of the screening process within 28 days prior to dosing

Annotated entities:
- Temporal: "within 28 days prior to dosing"
- Reference_point: "dosing"
- Procedure: "screening process"